Clinical trial exclusion criterion:
Have been treated with exogenous insulin for more than 1 week within the 3 months prior to screening.

Entity relations:
- Has_multiplier("exogenous insulin", "for more than 1 week")
- Has_temporal("exogenous insulin", "within the 3 months prior to screening")
- Has_index("within the 3 months prior to screening", "screening")